下列癌症何者有適當有效的篩檢方法？
A. 子宮頸癌
B. 卵巢癌
C. 子宮內膜癌
D. 肺癌

正確答案：A. 子宮頸癌